Clinical trial inclusion criterion:
Haemoglobin ≥ 9g/dL.

Entity relations:
- Has_value("Haemoglobin", "≥ 9g/dL")